下列那一項治療在減緩慢性腎衰竭的進行速率上，沒有效果？
A. 服用 ACEI（Angiotensin converting enzyme inhibitors）或 ARB（Angiotensin receptor blockers）來治療高血壓
B. 糖尿病患者嚴格控制血糖，維持 HbA1C＜7%
C. 服用 Kayexalate
D. 低蛋白飲食

正確答案：C. 服用 Kayexalate